Clinical trial exclusion criteria:
Pregnancy, age < 18, nursing, or documented allergy to naloxone

Annotated entities:
- Condition: "Pregnancy"
- Person: "age"
- Value: "< 18"
- Condition: "nursing"
- Condition: "allergy"
- Drug: "naloxone"